Comparando los test de hipótesis unilaterales (1 cola) y bilaterales (2 colas):
1. Los tests bilaterales siempre dan valores de p superiores.
2. Los tests bilaterales siempre dan valores de p menores.
3. Si un test unilateral es significativo, también lo será el bilateral.
4. Un test bilateral es más sensible que un unilateral.

Respuesta correcta: 1. Los tests bilaterales siempre dan valores de p superiores.